¿Cuál de las siguientes afirmaciones sobre el cuidado personal después de una colecistectomía laparoscópica, es INCORRECTA?
1. Empezar el ejercicio ligero (caminar) una semana después de la intervención.
2. Ducharse o bañarse después de 1 o 2 días.
3. Retomar la actividad sexual cuando se desee.
4. Si tenía intolerancia a la grasa antes de la operación, que añada grasa en forma gradual a su dieta habitual en aumentos pequeños.
5. Reanudar la dieta normal.

Respuesta correcta: 1. Empezar el ejercicio ligero (caminar) una semana después de la intervención.